Clinical trial exclusion criterion:
inadequate spoken finnish for reliable pain assessment

Entity relations:
- AND("inadequate spoken finnish", "reliable pain assessment")